¿Cuál es el objetivo fundamental de la terapia cognitiva para las alucinaciones auditivas en la esquizofrenia?:
1. Eliminar por completo la aparición de las alucinaciones auditivas.
2. Evitar escuchar las alucinaciones y evitar las situaciones que las provocan.
3. Conseguir que nadie se dé cuenta que la persona está teniendo las alucinaciones.
4. Reducir las creencias sobre la omnipotencia, la malevolencia, la benevolencia, y la obediencia, respecto a las voces.
5. Modificar las creencias que tienen sobre la esquizofrenia y la medicación.

Respuesta correcta: 4. Reducir las creencias sobre la omnipotencia, la malevolencia, la benevolencia, y la obediencia, respecto a las voces.